Which protein is the Mitochondrial carrier homolog 2 (MTCH2) receptor for?

Mitochondrial Carrier Homolog 2 (MTCH2) acts as a receptor for the BH3 interacting-domain death agonist (BID) in the mitochondrial outer membrane.